Clinical trial inclusion criterion:
Patient suffering from mild to moderate active proctitis or distal proctosigmoiditis (MAYO score ≥ 3 and ≤ 10) at inclusion based on clinical and endoscopic findings within 6 months before study inclusion.

Entity relations:
- Has_qualifier("active proctitis", "mild to moderate")
- Has_value("MAYO score", "≥ 3 and ≤ 10")
- Has_index("within 6 months before study inclusion", "study inclusion")
- Has_index("at inclusion", "inclusion")
- Has_temporal("active proctitis", "at inclusion")
- Has_temporal("active proctitis", "within 6 months before study inclusion")
- OR("active proctitis", "distal proctosigmoiditis")